Un aumento de la presión sanguínea entre 80 y 150 mmHg aumenta la diuresis porque:
1. Aumenta exponencialmente la filtración glomerular.
2. Disminuye la reabsorción peritubular del agua.
3. Se contrae la arteriola eferente.
4. Aumenta proporcionalmente el flujo sanguíneo renal.
5. Se contrae la arteriola aferente.

Respuesta correcta: 2. Disminuye la reabsorción peritubular del agua.